American Society of Anesthesiologists physical-health status classification (ASA-PS)>3

The above is a clinical trial exclusion criterion. Annotated with entity spans:
[Measurement: American Society of Anesthesiologists physical-health status classification (ASA-PS)][Value: >3]